Administration of doxycycline, azithromycin, chloramphenicol, rifampicin, or tetracycline during the preceding 7 days

The above is a clinical trial exclusion criterion. Annotated with entity spans:
Administration of [Drug: doxycycline], [Drug: azithromycin], [Drug: chloramphenicol], [Drug: rifampicin], or [Drug: tetracycline] [Temporal: during the preceding 7 days]